Clinical trial exclusion criterion:
Patient still in an exclusion period following the participation in another clinical trial.

Annotated entities:
- Competing_trial: "participation in another clinical trial"
- Temporal: "still in an exclusion period following"